Familial hypertriglyceridemia

The above is a clinical trial exclusion criterion. Annotated with entity spans:
[Condition: Familial hypertriglyceridemi]a